Clinical trial exclusion criterion:
current or regular use of psychiatric medications such as tranquilizers, antipsychotics, and/or antidepressants

Annotated entities:
- Drug: "psychiatric medications"
- Drug: "tranquilizers"
- Drug: "antipsychotics"
- Drug: "antidepressants"